Clinical trial exclusion criterion:
contraindication to the lumbar puncture

Annotated entities:
- Condition: "contraindication"
- Procedure: "lumbar puncture"